Contraindication to azithromycin use and other prophylactic antibiotic use

The above is a clinical trial exclusion criterion. Annotated with entity spans:
[Condition: Contraindication] to [Drug: azithromycin] use and [Qualifier: other] [Drug: prophylactic antibiotic use]